What is the function of the H19 (ICR) locus in the human genome?

The H19 locus acts in vivo as a tumor suppressor. The H19 locus belongs to a cluster of imprinted genes that is linked to the human Beckwith-Wiedemann syndrome. The expression of H19 and its closely associated IGF2 gene is frequently deregulated in some human tumors, such as Wilms' tumors.